Clinical trial exclusion criterion:
Ulcers older than 1 year.

Entity relations:
- Has_temporal("Ulcers", "older than 1 year")